Clinical trial exclusion criterion:
Clinically significant hepatic or renal disorder.

Annotated entities:
- Condition: "renal disorder"
- Condition: "hepatic disorder"
- Qualifier: "Clinically significant"
- Subjective_judgement: "Clinically significant"